Women who are breastfeeding

The above is a clinical trial exclusion criterion. Annotated with entity spans:
[Pregnancy_considerations: Women who are breastfeeding]